¿Qué dosis deberías administrar por vía oral cada 12 horas de un fármaco cuyo aclaramiento plasmático es igual a 1 L/h si se desea alcanzar una concentración media de equilibrio de 10mg/L? Asumir biodisponibilidad completa (F = 1):
1. 120 mg.
2. 12 mg.
3. 200 mg.
4. 10 mg.
5. Con esta información no es posible estimar la dosis necesaria para alcanzar esta concentración de equilibrio.

Respuesta correcta: 1. 120 mg.